right sided hemicolectomy

The above is a clinical trial exclusion criterion. Annotated with entity spans:
[Procedure: right sided hemicolectomy]